Clinical trial exclusion criterion:
Patients HIV+.

Annotated entities:
- Measurement: "HIV"
- Value: "+"
- Condition: "HIV+"